Clinical trial inclusion criterion:
Normotensive controls

Entity relations:
- Has_qualifier("controls", "Normotensive")